Clinical trial exclusion criterion:
Dual organ or kidney after another solid organ transplant

Entity relations:
- AND("Dual organ", "solid organ transplant")
- OR("Dual organ", "Dual kidney")